¿A qué se llama potencial óhmico?:
1. Al voltaje necesario para que pase corriente a través de la celda.
2. A la resistencia de la celda.
3. Es el potencial que mide el electrodo indicador cuando no pasa corriente.
4. Al potencial del electrodo auxiliar.

Respuesta correcta: 1. Al voltaje necesario para que pase corriente a través de la celda.